Clinical trial inclusion criterion:
Alcohol or drug abuse

Annotated entities:
- Condition: "Alcohol abuse"
- Condition: "drug abuse"